Clinical trial exclusion criterion:
Death expected within the next 48 h (moribund patients as defined by ASA = class V)

Annotated entities:
- Observation: "Death expected"
- Temporal: "within the next 48 h"
- Condition: "moribund"
- Measurement: "ASA"
- Value: "= class V"